What is minodixil approved for?

Minoxidil is the only topical drug approved for the treatment of both female and male pattern hair loss. In the US, minoxidil is approved over-the-counter (OTC) at a maximum concentration of 5%.